Clinical trial inclusion criterion:
Frequent HAs that started within 3months after a head injury. The HAs either 1) must last 4 or more hours a day and reach a moderate to severe intensity at any point during the headache, or 2) may be of any severity or duration if the participant takes a triptan or ergotamine. HAs meeting these criteria must have been present on average at least 8 days per 4-week period, starting within 30 days after head injury and occurring by self-report for at least 3 months prior to the Initial Screening Visit. The 4-week HA frequency/severity criteria must be confirmed during the Preliminary Screening Period.

Entity relations:
- Has_qualifier("HAs", "Frequent")
- Has_index("within 3months after a head injury", "a head injury")
- Has_temporal("HAs", "within 3months after a head injury")
- Has_index("at least 3 months prior to the Initial Screening Visit", "the Initial Screening Visit")
- Has_multiplier("HAs", "last 4 or more hours a day")
- Has_multiplier("HAs", "at least 8 days per 4-week period")
- Has_temporal("HAs", "within 30 days after head injury")
- Has_temporal("HAs", "at least 3 months prior to the Initial Screening Visit")
- Has_qualifier("HAs", "moderate to severe intensity")
- OR("triptan", "ergotamine")
- OR("last 4 or more hours a day", "triptan")
- OR("moderate to severe intensity", "triptan")